Clinical trial inclusion criterion:
Adult (age 18 years and older)

Entity relations:
- Has_value("age", "18 years and older")